Clinical trial exclusion criterion:
current diagnosis of a mood, anxiety, or other disorder that is more clinically salient than PTSD

Entity relations:
- Has_qualifier("disorder", "other")
- multi("more clinically salient than PTSD", "PTSD")
- Has_qualifier("mood disorder", "more clinically salient than PTSD")
- OR("mood disorder", "disorder", "anxiety disorder")